Clinical trial inclusion criterion:
Women be at least 18 years of age

Entity relations:
- Has_value("age", "at least 18 years")